Steroid therapy

The above is a clinical trial exclusion criterion. Annotated with entity spans:
[Drug: Steroid therapy]